La isquemia aguda de una extremidad consiste en una disminución brusca de la perfusión arterial. Es importante diferenciar entre trombosis y embolia arterial para poder indicar el tratamiento más adecuado. ¿Cuál de las siguientes es la correcta?
1. La presencia de foco embolígeno y pulsos distales en la extremidad contralateral hace sospechar una trombosis arterial.
2. Si el paciente tiene antecedentes de claudicación y la clínica es de inicio brusco sospecharemos embolia arterial en primer lugar.
3. Si la extremidad contralateral tiene todos los pulsos presentes y la clínica se inicia de forma lenta, sospecharemos una trombosis arterial.
4. Si la clínica se inicia de forma brusca en un paciente con foco embolígeno sospecharemos una embolia arterial.
5. Si el paciente es portador de una derivación arterial previa sospecharemos de embolia arterial.

Respuesta correcta: 4. Si la clínica se inicia de forma brusca en un paciente con foco embolígeno sospecharemos una embolia arterial.